Clinical trial exclusion criterion:
Serious heart insufficiency, liver insufficiency, renal insufficiency and other serious medical problems

Entity relations:
- Has_qualifier("heart insufficiency", "Serious")
- Has_qualifier("serious medical problems", "other")
- OR("heart insufficiency", "liver insufficiency", "serious medical problems", "renal insufficiency")